下列關於glioblastoma multiforme的治療，何者正確？
A. 不論接受何種治療，病患都有良好的預後
B. 手術切除加術後放射線治療及化學治療是目前效果最佳的治療方式
C. 若可手術切除，可不做術後放射線治療及化學治療
D. 腫瘤可與周邊正常組織清楚區分，容易手術完全切除

正確答案：B. 手術切除加術後放射線治療及化學治療是目前效果最佳的治療方式